60歲肥胖男性病患，曾接受闌尾切除，體檢時曾得知膽結石，但無明顯症狀，有喝酒習慣。5天前因聚餐 後，突發整個上腹部有壓痛，發燒（39°C ）、血中白血球18,000 / mm3，N/L= 83%/16%；黃疸值（total bilirubin 5.6 mg/dL），則應做那項進一步的處置？
A. 備血、輸血
B. 安排緊急腹部剖腹手術
C. 安排血管攝影檢查以及血管栓塞處置
D. 安排腹部超音波

正確答案：D. 安排腹部超音波